Clinical trial exclusion criterion:
Inflammatory condition e.g. Connective tissue disorder, Rheumatoid arthritis

Entity relations:
- Subsumes("Inflammatory", "Connective tissue disorder,")
- OR("Connective tissue disorder,", "Rheumatoid arthritis")